Clinical trial exclusion criterion:
major illness

Annotated entities:
- Qualifier: "major"
- Condition: "illness"